Clinical trial exclusion criterion:
Unwillingness or inability to adhere to treatment or to the follow-up visits

Annotated entities:
- Post-eligibility: "Unwillingness or inability to adhere to treatment or to the follow-up visits"